What is the association of the protein RAB10 and Alzheimers disease?

The genes SEC22B, RAB10 and FLT1 may be potential biomarkers of AD.